Clinical trial exclusion criterion:
acutely sick (for example, crying, wheezing, bleeding, screaming or shaken)

Annotated entities:
- Condition: "acutely sick"
- Condition: "crying"
- Condition: "wheezing"
- Condition: "bleeding"
- Condition: "screaming"
- Condition: "shaken"